下列那一項不是 Dihydrotestosterone 之作用？
A. 外生殖器之生長
B. 前列腺之生長
C. 毛髮之生長
D. 精子之製造

正確答案：D. 精子之製造